79歲女性，自訴以往健康良好，沒有服用任何藥物或營養品，某天早上起床時發現全身四肢有多處瘀青。隔日就診，身體檢查發現口腔裡有多處潰瘍和血塊。血球檢查數據如下（括弧內是正常參考數值）：RBC 5.02  M/μL（3.78～4.99），Hb 11.1 g/dL（10.8～14.9），Hct 34.6 %（35.6～45.4），MCV 68.9 fL（80～100），
 PLT 5 K/μL（150～361），WBC 10.14 K/μL（3.54～9.06），白血球分類：Seg 58.1%，Eos. 1.0%，Baso. 
 4%，Mono. 4.1%，Lym. 36.4%。以下何項敘述錯誤？
A. 病人應考慮接受骨髓檢查協助診斷
B. 病人有可能是假性的血小板低下症，需要用含肝素（heparin）的採血管採集病人的血液之後，再做一次檢查
C. 病人應該立即輸注血小板濃縮液
D. 病人應避免劇烈活動

正確答案：B. 病人有可能是假性的血小板低下症，需要用含肝素（heparin）的採血管採集病人的血液之後，再做一次檢查